Clinical trial exclusion criterion:
patients in dual antiplatelet therapy;

Annotated entities:
- Procedure: "dual antiplatelet therapy"